下列關於單元性（single-unit）平滑肌的敘述，何者錯誤？
A. 每個細胞必須接受神經調控，產生收縮作用
B. 細胞間有許多的裂隙接合（gap junction）
C. 也許會有節律器的活動
D. 受到牽拉時會產生收縮

正確答案：A. 每個細胞必須接受神經調控，產生收縮作用